Clinical trial inclusion criterion:
Prior to the acute attack of LBP, back pain cannot occur more frequently than once per month. Patients with more frequent back pain are at increased risk of poor pain and functional outcomes.(9)

Annotated entities:
- Temporal: "acute"
- Condition: "attack of LBP"
- Negation: "cannot"
- Condition: "back pain"
- Temporal: "Prior to the acute attack of LBP"
- Reference_point: "acute attack of LBP"
- Multiplier: "more frequently than once per month"